Clinical trial inclusion criterion:
Age from 40 to 75 years

Entity relations:
- Has_value("Age", "from 40 to 75 years")